Clinical trial exclusion criterion:
9. Use of tobacco products and/or history of smoking within the past 2 months

Annotated entities:
- Parsing_Error: "9."
- Drug: "tobacco products"
- Observation: "smoking"
- Temporal: "within the past 2 months"
- Temporal: "history"